Normal acquired/inherited thrombophilia profile: LAC, ACA IgG/IgM, Prot S, Antithrombin III, beta-2 glycoprotein, Factors V, II, MTHFR.

The above is a clinical trial inclusion criterion. Annotated with entity spans:
[Value: Normal] acquired/inherited [Measurement: thrombophilia profile]: [Measurement: LAC], [Measurement: ACA IgG]/IgM, [Measurement: Prot S], [Measurement: Antithrombin III], [Measurement: beta-2 glycoprotein], [Measurement: Factors V], II, [Measurement: MTHFR].